Patients who have received no less than 20 transfusions of RBCs;

The above is a clinical trial inclusion criterion. Annotated with entity spans:
Patients who have received [Multiplier: no less than 20] [Procedure: transfusions of RBCs];